structural and functional urogenital abnormalities, that predispose for urogenital infections

The above is a clinical trial exclusion criterion. Annotated with entity spans:
[Qualifier: structural] [Parsing_Error: and] [Qualifier: functional] [Condition: urogenital abnormalities], that [Observation: predispose for urogenital infections]